Clinical trial inclusion criterion:
Patients receiving hemoporfin based upon the clinical judgment of the investigator;

Annotated entities:
- Drug: "hemoporfin"